¿En qué fase de la terapia de resolución de problemas se utilizan los principios de cantidad, aplazamiento de juicio y variedad?
1. Toma de decisiones.
2. Orientación hacia el problema.
3. Definición y formulación del problema.
4. Generación de soluciones alternativas.
5. Puesta en práctica y verificación de la solución.

Respuesta correcta: 4. Generación de soluciones alternativas.